Known hypersensitivity to perflutren (contained in Definity)

The above is a clinical trial exclusion criterion. Annotated with entity spans:
Known [Condition: hypersensitivity] to [Drug: perflutren] (contained in [Drug: Definity])